Clinical trial inclusion criteria:
Men or women aged 18 years or older
Patients presenting for CMR with the clinical diagnosis of hypertrophic cardiomyopathy based on left ventricular wall thickness of at least =15 mm in the absence of any other cardiac or systemic cause of hypertrophy
Patients presenting for CMR with the clinical diagnosis of idiopathic dilated cardiomyopathy based upon left ventricular ejection fraction =40%, LV end-diastolic diameter =55 mm or left ventricular end-systolic diameter =45 mm, and the absence of coronary stenoses on angiography.
Patients presenting for CMR evaluation of chest pain but without evidence of obstructive coronary artery disease either by coronary angiography or stress testing.

Annotated entities:
- Person: "Men"
- Person: "women"
- Person: "aged"
- Value: "18 years or older"
- Condition: "hypertrophic cardiomyopathy"
- Measurement: "left ventricular wall thickness"
- Value: "at least =15 mm"
- Negation: "absence"
- Condition: "systemic cause of hypertrophy"
- Condition: "cardiac cause of hypertrophy"
- Condition: "idiopathic dilated cardiomyopathy"
- Measurement: "left ventricular ejection fraction"
- Value: "=40%"
- Measurement: "LV end-diastolic diameter"
- Value: "=55 mm"
- Measurement: "left ventricular end-systolic diameter"
- Value: "=45 mm"
- Negation: "absence"
- Condition: "coronary stenoses"
- Procedure: "angiography"
- Condition: "chest pain"
- Negation: "without"
- Condition: "obstructive coronary artery disease"
- Procedure: "coronary angiography"
- Procedure: "stress testing"